Clinical trial inclusion criteria:
Patients aged 19 or older
Patients who have submitted a written consent to participate in the clinical trial
De novo lesion
Patients scheduled for elective intervention to treat ischemic cardiovascular disease

Annotated entities:
- Person: "aged"
- Value: "19 or older"
- Informed_consent: "Patients who have submitted a written consent to participate in the clinical trial"
- Condition: "De novo lesion"
- Post-eligibility: "Patients scheduled for elective intervention to treat ischemic cardiovascular disease"